Mitomycin C 和下列何種症候群有關？
A. hand-foot syndrome
B. hemolytic uremic syndrome
C. hyperviscosity syndrome
D. capillary leak syndrome

正確答案：B. hemolytic uremic syndrome